周邊雷射虹膜穿孔術（peripheral laser iridotomy）主要用來治療何種青光眼（glaucoma）？
A. 隅角開放性青光眼（open angle glaucoma）
B. 隅角閉鎖性青光眼（angle closure glaucoma）
C. 正常眼壓性青光眼（normal tension glaucoma）
D. 血管增生性青光眼（neovascular glaucoma）

正確答案：B. 隅角閉鎖性青光眼（angle closure glaucoma）